Señale cuál de los siguientes constituye un importante marcador fisiológico en la esquizofrenia:
1. Movimientos oculares.
2. Inhibición psicomotora.
3. Secreción salivar.
4. Ritmo cardiaco.

Respuesta correcta: 1. Movimientos oculares.